Clinical trial exclusion criterion:
Anamnestic history of hypersensitivity to the study drugs or to drugs with similar chemical structures

Annotated entities:
- Temporal: "Anamnestic history"
- Condition: "hypersensitivity"
- Drug: "study drugs"
- Drug: "drugs with similar chemical structures"